RET fusion positive or FGFR2 fusion/other FGFR mutation Refractory solid tumor and/or specific sensitivity to Sunitinib by Avatar scan that has progressed following standard therapy or that has not responded to standard therapy or for which there is no standard therapy.

The above is a clinical trial inclusion criterion. Annotated with entity spans:
[Measurement: RET fusion] [Value: positive] or [Qualifier: FGFR2 fusion]/other [Qualifier: FGFR mutation] [Qualifier: Refractory] [Condition: solid tumor] and/or specific [Qualifier: sensitivity] to [Drug: Sunitinib] b[Non-query-able: y Avatar scan that has progressed following standard therapy or that has not responded to standard therapy or for which there is no standard therapy].